一位 45 歲男性，因發燒及肛門疼痛兩天而來急診。理學檢查如下：體溫 38.5℃，肛門左側距肛門口約 4 公分處有一個約 5 公分大之膿瘍，其血糖為 230 mg/dL，白血球為 18,000/mm3。對於該病人的處置，何者最恰當？
A. 給予口服抗生素及退燒藥，轉至門診
B. 給予靜脈點滴注射抗生素，收住院觀察發燒變化
C. 給予靜脈點滴注射抗生素，在急診室使用局部麻醉將膿瘍劃開引流
D. 給予靜脈點滴注射抗生素，安排手術房，半身麻醉將膿瘍劃開引流

正確答案：D. 給予靜脈點滴注射抗生素，安排手術房，半身麻醉將膿瘍劃開引流